Current stimulant treatment

The above is a clinical trial exclusion criterion. Annotated with entity spans:
[Temporal: Current] [Procedure: stimulant treatment]